Clinical trial inclusion criterion:
has a negative pregnancy test on the day of vaccination and

Entity relations:
- Has_value("pregnancy test", "negative")
- Has_index("on the day of vaccination", "vaccination")
- Has_temporal("pregnancy test", "on the day of vaccination")